Rifabutin, rifampin or rifapentine

The above is a clinical trial exclusion criterion. Annotated with entity spans:
[Drug: Rifabutin], [Drug: rifampin] or [Drug: rifapentine]